Clinical trial exclusion criterion:
Significant valve disease (severe aortic stenosis or regurgitation; severe mitral regurgitation)

Entity relations:
- Has_qualifier("aortic stenosis", "severe")
- Has_qualifier("mitral regurgitation", "severe")
- OR("aortic stenosis", "regurgitation")
- OR("aortic stenosis", "mitral regurgitation")